下列有關調節型T細胞（regulatory T cells, Treg）的敘述何者正確？
A. 腫瘤可以調控microenvironment 的T細胞分化成Treg細胞，以逃脫免疫系統的追殺
B. Treg細胞的功能的過度活化，是許多自體免疫疾病發病的重要因素
C. Treg細胞都是在周邊淋巴組織分化而成
D. Treg細胞表面帶有CD8的標記，可以幫助清除胞內病原感染

正確答案：A. 腫瘤可以調控microenvironment 的T細胞分化成Treg細胞，以逃脫免疫系統的追殺